Clinical trial exclusion criterion:
Having undergone lung surgery (e.g. lung resection including lung volume reduction surgery, lung transplant) or subjects scheduled for surgery.

Annotated entities:
- Procedure: "lung surgery"
- Procedure: "lung resection"
- Procedure: "lung volume reduction surgery"
- Procedure: "lung transplant"
- Procedure: "surgery"
- Mood: "scheduled"